11. Infectious disease screen is positive for HIV or Hepatitis A, B or C.

The above is a clinical trial exclusion criterion. Annotated with entity spans:
[Parsing_Error: 11.] Infectious disease screen is positive for [Condition: HIV] or [Condition: Hepatitis A], B or C.